What cellular process is JAK/STAT involved in?

The serine/threonine kinase JAK/STAT is a major regulator of Janus kinase activity and plays a critical role in regulating the ubiquitin/proinflammatory signaling pathway.